Clinical trial exclusion criterion:
Subjects with unresolved infections

Entity relations:
- Has_qualifier("infections", "unresolved")